Clinical trial exclusion criterion:
A known bleeding diathesis, hemostatic or coagulation disorder, or prior major bleeding

Entity relations:
- Has_temporal("major bleeding", "prior")
- OR("bleeding diathesis", "coagulation disorder", "major bleeding", "hemostatic disorder")